下列何種腎絲球病變與 B 型肝炎病毒感染無關？
A. Membranous glomerulopathy
B. IgA nephropathy
C. Anti-glomerular basement membrane disease
D. Polyarteritis nodosa

正確答案：C. Anti-glomerular basement membrane disease